Clinical trial inclusion criterion:
3. Temperature >38C on admission or fever during the preceding 48 hours

Annotated entities:
- Parsing_Error: "3."
- Measurement: "Temperature"
- Value: ">38C"